Clinical trial inclusion criterion:
The patient must have severe, symptomatic (ACC/AHA Stage D symptoms) tricuspid regurgitation (TR) as assessed by 2D echocardiogram with evidence of peripheral and central venous congestion (specifically lower extremity edema and abdominal ascites requiring diuretics.)

Annotated entities:
- Qualifier: "severe"
- Qualifier: "symptomatic"
- Condition: "tricuspid regurgitation"
- Condition: "TR"
- Measurement: "ACC/AHA"
- Value: "Stage D"
- Procedure: "2D echocardiogram"
- Condition: "peripheral venous congestion"
- Condition: "central venous congestion"
- Condition: "lower extremity edema"
- Condition: "abdominal ascites"
- Drug: "diuretics"